Why is fingolimod considered a prodrug?

FTY720/fingolimod, is considered a prodrug because it requires in vivo phosphorylation to its active phosphorylated form.